Clinical trial inclusion criterion:
Patients able to comply with follow-up requirements including self-evaluations

Annotated entities:
- Post-eligibility: "atients able to comply with follow-up requirements including self-evaluations"